Clinical trial inclusion criterion:
Initial WBC < 20,000/µL

Entity relations:
- Has_value("WBC", "< 20,000/µL")
- Has_qualifier("WBC", "Initial")